Clinical trial inclusion criterion:
Normal and healthy (immune competent) as determined by medical history, physical exam, vital signs and clinical laboratory tests during the screening period.

Annotated entities:
- Qualifier: "Normal"
- Qualifier: "healthy"
- Temporal: "during the screening period"
- Reference_point: "screening period"
- Temporal: "medical history"
- Procedure: "physical exam"
- Measurement: "vital signs"
- Measurement: "clinical laboratory tests"